Clinical trial exclusion criterion:
Active substance dependency

Annotated entities:
- Condition: "substance dependency"